Females who are pregnant, become to be pregnant or breastfeeding or males whose partners are pregnant, become to be pregnant or breastfeeding.

The above is a clinical trial exclusion criterion. Annotated with entity spans:
[Person: Females] who are [Condition: pregnant], [Observation: become] to be [Condition: pregnant] or [Observation: breastfeeding] or [Person: males] whose [Non-query-able: partners are pregnant, become to be pregnant or breastfeeding].